Patients taking anticoagulant medication

The above is a clinical trial exclusion criterion. Annotated with entity spans:
Patients taking [Drug: anticoagulant] medication